La lesión a nivel de las raíces posteriores de la médula espinal produce:
1. Afectación de todas las formas de sensibilidad en distribución metamérica y homolateral.
2. Afectación homolateral de todas las formas de sensibilidad por debajo del punto de lesión.
3. Termoanalgesia de distribución metamérica y bilateral.
4. Termoanalgesia por debajo de la lesión y contralateral.
5. Anestesia profunda por debajo de la lesión y contralateral.

Respuesta correcta: 1. Afectación de todas las formas de sensibilidad en distribución metamérica y homolateral.